Clinical trial exclusion criterion:
Has aphakia, keratoconus or a highly irregular cornea.

Entity relations:
- OR("aphakia", "keratoconus", "highly irregular cornea")